Females of childbearing potential who are not using adequate contraceptive methods (as required by local law or practice)

The above is a clinical trial exclusion criterion. Annotated with entity spans:
[Pregnancy_considerations: Females of childbearing potential who are not using adequate contraceptive methods (as required by local law or practice)]